下列何種藥物對鈉離子通道之結合與分離速率最快？
A. quinidine
B. amiodarone
C. flecainide
D. lidocaine

正確答案：D. lidocaine